Clinical trial exclusion criterion:
Continuous and/or progressive visual loss > 18 months or serous detachment on OCT > 18 months;

Entity relations:
- Has_qualifier("visual loss", "Continuous")
- Has_temporal("OCT", "> 18 months")
- Has_temporal("visual loss", "> 18 months")
- AND("OCT", "serous detachment")
- OR("Continuous", "progressive")
- OR("visual loss", "OCT")